鈣離子（calcium ion）是細胞內重要之二級訊息傳遞者，下列何種物質可影響細胞內鈣離子的濃度？
A. phosphatidylcholine+phospholipase A
B. phosphatidylcholine+phospholipase C
C. phosphatidylinositol+phospholipase A
D. phosphatidylinositol+phospholipase C

正確答案：D. phosphatidylinositol+phospholipase C